Clinical trial exclusion criterion:
A known contraindication or hypersensitivity to all anticoagulation regimens, or inability to be anticoagulated for the study procedure.

Annotated entities:
- Condition: "contraindication"
- Condition: "hypersensitivity"
- Procedure: "anticoagulation regimens"
- Condition: "inability"
- Procedure: "anticoagulated"
- Temporal: "for the study procedure"
- Reference_point: "study procedure"